Clinical trial inclusion criterion:
Phase II: Patients must have histologically confirmed R/R NHL (as defined by WHO criteria). Patients with NHL other than diffuse large B cell lymphomas (DLBCL) must have received at least 2 prior therapies. Patients with DLBCL will be eligible if there is no available standard therapy.

Annotated entities:
- Measurement: "histologically"
- Qualifier: "R/R"
- Condition: "NHL"
- Measurement: "WHO criteria"
- Value: "confirmed"
- Condition: "NHL"
- Condition: "diffuse large B cell lymphomas (DLBCL)"
- Negation: "other than"
- Multiplier: "at least 2"
- Temporal: "prior"
- Procedure: "therapies"
- Undefined_semantics: "therapies"
- Context_Error: "therapies"
- Condition: "DLBCL"
- Procedure: "standard therapy"
- Undefined_semantics: "standard therapy"
- Negation: "no"